關於總膽管結石之敘述，下列何者錯誤？
A. 阻塞性黃疸為最典型症狀
B. 膽囊切除術後經過半年才發現者視為原發性總膽管結石
C. 腹部超音波常可見總膽管擴張
D. 經內視鏡逆行性膽道攝影除可診斷外亦可用於治療

正確答案：B. 膽囊切除術後經過半年才發現者視為原發性總膽管結石